美莉20週產檢時，發現twin A預估體重532 g且羊水過多，twin B 417 g且 沒有羊水，twin B 的臍動脈杜普勒波形測量已有舒張期逆流情形（reverse end-diastolic flow），美莉和先生希望能積極救兩個胎兒，目前文獻對於早期嚴重性TTTS，下列那一種治療較佳？
A. 利用胎兒鏡做雷射治療（laser ablation of vascular anastomoses）
B. 將羊水過多的放水（amnioreduction of the recipient）
C. 將兩個胎兒間的羊膜打通（septostomy）
D. 灌水到沒有羊水的胎兒內（amnio infusion of the donor）

正確答案：A. 利用胎兒鏡做雷射治療（laser ablation of vascular anastomoses）